百米選手在激烈運動下，骨骼肌內之糖解作用（glycolysis）所產生的NADH，最主要經由下列何種反應再氧化生成NAD+？
A. α-ketoglutarate反應成為succinyl-CoA
B. pyruvate反應成為lactate
C. coenzyme Q反應成為cytochrome b
D. pyruvate反應成為acetyl-CoA

正確答案：B. pyruvate反應成為lactate